Clinical trial exclusion criterion:
Women with history of previous thromboembolic disorders

Entity relations:
- Has_temporal("thromboembolic disorders", "previous")
- Has_temporal("thromboembolic disorders", "history")